Clinical trial exclusion criterion:
Morbid obesity (BMI=40kg/m2)

Annotated entities:
- Condition: "Morbid obesity"
- Measurement: "BMI"
- Value: "40kg/m2"